Clinical trial inclusion criterion:
History of at least two moderate or severe exacerbations that required change in treatment (antibiotics, systemic steroids, hospitalization) in the last 18 months prior to date of screening , with at least one of these occurring within the last 12 months prior to screening.

Entity relations:
- Has_qualifier("exacerbations", "moderate")
- Has_context("required change in treatment", "change in treatment")
- Has_multiplier("exacerbations", "at least two")
- Has_qualifier("systemic steroids", "systemic")
- Has_index("in the last 18 months prior to date of screening", "date of screening")
- Has_index("within the last 12 months prior to screening", "screening")
- Has_temporal("at least one", "within the last 12 months prior to screening")
- AND("change in treatment", "treatment")
- Subsumes("treatment", "antibiotics")
- Has_qualifier("exacerbations", "required change in treatment")
- Has_temporal("change in treatment", "in the last 18 months prior to date of screening")
- Has_multiplier("required change in treatment", "at least one")
- OR("moderate", "severe")
- OR("antibiotics", "systemic steroids", "hospitalization")